La reacción de un halogenuro de alquilo con un compuesto aromático en presencia un ácido de Lewis se conoce como:
1. Acilación de Friedel-Crafts.
2. Alquilación de Friedel-Crafts.
3. Condensación benzoínica.
4. Reacción aldólica.

Respuesta correcta: 2. Alquilación de Friedel-Crafts.